下列關於角膜之鹼性化學灼傷（alkaline burns）的敘述，何者正確？
A. 一般而言，與酸性化學灼傷（acid burns）比較，鹼性化學灼傷（alkaline burns）預後較佳
B. 儘速以酸性水溶液沖洗眼睛，以中和鹼性傷害
C. 前10天絕對禁止類固醇使用，避免抑制傷口癒合
D. 角膜輪部缺血（limbal ischaemia）程度是影響視力預後的重要因子

正確答案：D. 角膜輪部缺血（limbal ischaemia）程度是影響視力預後的重要因子